Clinical trial exclusion criterion:
Any major organ system disease (by judgment of the study medical team)

Annotated entities:
- Condition: "major organ system disease"